Clinical trial inclusion criterion:
Adult patients (older than 18 years of age), male and female, with chronic non-cancer and cancer pain (at least 3 months in duration)

Entity relations:
- Has_value("age", "older than 18 years")
- Subsumes("Adult", "age")
- Has_qualifier("pain", "non-cancer")
- Has_qualifier("pain", "chronic")
- Subsumes("chronic", "at least 3 months in duration")
- OR("male", "female")
- OR("non-cancer", "cancer")